Señale la respuesta correcta. “Aplicar las tecnologías y sistemas de información y comunicación de los cuidados de salud” es una competencia que habilita para el ejercicio de la profesión de enfermero y que está recogida en:
1. Real Decreto 1393/2007.
2. Ley 44/2003.
3. Real Decreto 1093/2010.
4. Orden CIN 2134/2008.

Respuesta correcta: 4. Orden CIN 2134/2008.